Clinical trial exclusion criterion:
23. Use of investigational medications within 30 days before study entry

Entity relations:
- Has_index("within 30 days before study entry", "study entry")
- Has_temporal("investigational medications", "within 30 days before study entry")